Señale de entre las siguientes la complicación más probable que presenta el paciente intervenido, hace 20 años, de úlcera gástrica mediante antrectomía y gastroyeyunostomía (Billroth II) que acude a su consulta refiriendo dolor abdominal postpradial, distensión abdominal, diarrea y datos analíticos de malabsorción de grasas y de vitamina B12:
1. Gastropatía por reflujo biliar.
2. Adenocarcinoma gástrico.
3. Síndrome de evacuación gástrica rápida (dumping).
4. Síndrome de asa aferente con sobrecrecimiento bacteriano.

Respuesta correcta: 4. Síndrome de asa aferente con sobrecrecimiento bacteriano.